Any history of allergic reaction to local anesthetics, gastrointestinal bleeding or ulceration;

The above is a clinical trial exclusion criterion. Annotated with entity spans:
Any [Temporal: history] of [Condition: allergic reaction] to [Drug: local anesthetics], [Condition: gastrointestinal bleeding] or ulceration;